Clinical trial exclusion criterion:
Any condition which, in the opinion of the investigator, prevents the subject from participation in the study.

Entity relations:
- Has_qualifier("condition", "which prevents the subject from participation in the study")
- AND("which prevents the subject from participation in the study", "in the opinion of the investigator")